有關成本效用分析（cost-utility analysis），下列敘述何者較不正確？
A. 常以健康人年（quality-adjusted life year，簡寫為QALY）來測量病人治療的結果
B. 屬於成本效益分析法（cost-effectiveness analysis） 的一種特殊類型
C. 以金錢價值衡量醫療之產出
D. 醫學及公共衛生用來評估治療成效的方法之一

正確答案：C. 以金錢價值衡量醫療之產出